The patient is currently using or has used cannabinoid based medications within 90 days of study entry and is unwilling to abstain for the duration of the study

The above is a clinical trial exclusion criterion. Annotated with entity spans:
The patient is currently using or has used [Drug: cannabinoid based medications] [Temporal: within 90 days of study entry] and is unwilling to abstain for the duration of the study